risk of harm to self or others that requires immediate intervention

The above is a clinical trial exclusion criterion. Annotated with entity spans:
[Non-query-able: risk of harm to self or others that requires immediate intervention]